Las proteínas unidas por GPI (glucosil fosfatidilinositol) a la membrana plasmática se localizan:
1. Siempre en la cara citoplasmática.
2. Siempre en la cara extracelular.
3. Indistintamente en la cara citoplasmática o en la cara extracelular.
4. Siempre en el interior de la membrana.

Respuesta correcta: 2. Siempre en la cara extracelular.